Clinical trial exclusion criterion:
have actively suicidal thought(Suicidal ideation score of MADRS is 6)

Entity relations:
- Has_value("Suicidal ideation score of MADRS", "6")
- Subsumes("actively suicidal thought", "Suicidal ideation score of MADRS")